What 3 disorders are commonly associated with Kaufman-McKusick syndrome?

Clinical symptoms of Kaufman-McKusick syndrome (KM) include postaxial polydactyly, hydrometrocolpos, and congenital heart disease.